多發性硬化症患者的腦脊髓液常可見到下列何種情形？
A. 葡萄糖量為血糖中的 20%以下
B. 蛋白質降低
C. 每微升（µL）有 100 顆以上的白血球
D. 免疫球蛋白 G（IgG）升高

正確答案：D. 免疫球蛋白 G（IgG）升高